Clinical trial exclusion criterion:
Contraindication to administration of Gadolinium (Gd) based contrast agents (GBCA):

Entity relations:
- AND("Contraindication", "Gadolinium (Gd) based contrast agents (GBCA)")